Platelet count <80,000 or >700,000 cells/mm3, or white blood cell count <3,000 cells/mm3 if persistent (at least 2 abnormal values) within 7 days prior to index procedure.

The above is a clinical trial inclusion criterion. Annotated with entity spans:
[Measurement: Platelet count] [Value: <80,000 or >700,000 cells/mm3], or [Measurement: white blood cell count] [Value: <3,000 cells/mm3] if persistent (at least 2 abnormal values) [Temporal: within 7 days prior to index procedure].